Suspicion of chorioamnionitis

The above is a clinical trial exclusion criterion. Annotated with entity spans:
[Mood: Suspicion of] [Condition: chorioamnionitis]